Clinical trial exclusion criteria:
Has any clinically significant condition or situation (eg, anatomical malformation that complicates intubation) other than the condition being studied that, in the opinion of the investigator, would interfere with the trial evaluations or optimal participation in the trial.
Has a neuromuscular disorder that may affect NMB and/or trial assessments.
Is dialysis-dependent or has (or is suspected of having) severe renal insufficiency (defined as estimated glomerular filtration rate (eGFR) <30 ml/min).
Has or is suspected of having a family or personal history of malignant hyperthermia.
Has or is suspected of having an allergy to study treatments or its/their excipients, to opioids/opiates, muscle relaxants or their excipients, or other medication(s) used during general anesthesia.
Has received or is planned to receive toremifene and/or fusidic acid via IV administration within 24 hours before or within 24 hours after administration of study treatment.
Has been previously treated with sugammadex or has participated in a sugammadex clinical trial.
Is currently participating in or has participated in an interventional clinical trial with an investigational compound or device within 30 days of signing the informed consent/assent for this current trial.

Annotated entities:
- Qualifier: "clinically significant"
- Condition: "condition"
- Observation: "situation"
- Qualifier: "anatomical malformation"
- Negation: "other than"
- Condition: "the condition being studied"
- Observation: "interfere with the trial evaluations"
- Observation: "interfere with optimal participation"
- Condition: "neuromuscular disorder"
- Observation: "affect NMB"
- Observation: "affect trial assessments"
- Condition: "dialysis-dependent"
- Condition: "severe renal insufficiency"
- Measurement: "estimated glomerular filtration rate (eGFR)"
- Value: "<30 ml/min"
- Temporal: "personal history"
- Observation: "family"
- Condition: "malignant hyperthermia"
- Condition: "allergy"
- Procedure: "study treatments"
- Drug: "opioids"
- Drug: "opiates"
- Drug: "muscle relaxants"
- Drug: "excipients"
- Drug: "medication"
- Qualifier: "other"
- Procedure: "general anesthesia"
- Temporal: "during general anesthesia"
- Drug: "excipients"
- Drug: "toremifene"
- Mood: "planned to"
- Drug: "fusidic acid"
- Qualifier: "IV administration"
- Temporal: "within 24 hours before administration of study treatment"
- Temporal: "within 24 hours after administration of study treatment"
- Reference_point: "administration of study treatment"
- Reference_point: "administration of study treatment"
- Drug: "sugammadex"
- Temporal: "previously"
- Observation: "participated in clinical trial"
- Drug: "sugammadex"
- Observation: "has participated in an interventional clinical trial"
- Observation: "currently participating in an interventional clinical trial"
- Drug: "investigational compound"
- Device: "device"
- Temporal: "within 30 days of signing the informed consent"
- Reference_point: "signing the informed consent"
- Temporal: "within 30 days of signing the informed assent"
- Reference_point: "signing the informed assent"